Willing to comply with all study procedures and be available for the duration of the study.

The above is a clinical trial inclusion criterion. Annotated with entity spans:
[Post-eligibility: Willing to comply with all study procedures and be available for the duration of the study.]